Clinical trial inclusion criterion:
ejection fraction = 30%

Entity relations:
- Has_value("ejection fraction", "= 30%")